Cuando el individuo es incapaz de recordar información personal importante, generalmente un acontecimiento traumático o estresante ¿en qué trastorno podemos pensar, dentro del grupo de los trastornos disociativos (DSM-IV-TR)?
1. El trastorno de identidad disociativa.
2. El trastorno de trance disociativa.
3. La amnesia generalizada.
4. La amnesia disociativa.
5. La fuga disociativa.

Respuesta correcta: 4. La amnesia disociativa.